Clinical trial exclusion criterion:
History of infection or intraarticular fracture of the affective hip

Annotated entities:
- Condition: "infection"
- Condition: "intraarticular fracture"
- Qualifier: "affective hip"
- Temporal: "History"